Clinical trial exclusion criterion:
Underlying Rheumatoid arthritis, stroke, malignancy, venous occlusion

Entity relations:
- Has_qualifier("Rheumatoid arthritis", "Underlying")
- OR("Rheumatoid arthritis", "malignancy", "stroke", "venous occlusion")